Predominant overactive bladder symptoms

The above is a clinical trial exclusion criterion. Annotated with entity spans:
[Qualifier: Predominant] [Condition: overactive bladder symptoms]